Clinical trial inclusion criteria:
Patients undergoing robotic-assisted laparoscopic prostatectomy
=18 years old males
ASA class 1-4

Annotated entities:
- Procedure: "obotic-assisted laparoscopic prostatectomy"
- Value: "=18 years old"
- Person: "males"
- Person: "years"
- Measurement: "ASA class"
- Value: "1-4"